Age of at least 18 years

The above is a clinical trial inclusion criterion. Annotated with entity spans:
[Person: Age] of [Value: at least 18 years]